Clinical trial exclusion criterion:
Pregnant or lactating.

Entity relations:
- OR("Pregnant", "lactating")